8. intent to use NSAIDs or steroids

The above is a clinical trial exclusion criterion. Annotated with entity spans:
8. intent to use [Drug: NSAIDs] or [Drug: steroids]